Clinical trial exclusion criterion:
clinical significant macular edema in both eyes and indication for intravitreal anti-VEGF treatment for both eyes at screening or baseline visit. Eyes with a small amount of intraretinal or subretinal fluid (seen in OCT) but no need for intravitreal treatment as judged by the investigator (according to current practice patterns) may be included. Eyes with a history of intravitreal treatment of macular edema which do not need ongoing intravitreal treatment at the time of screening may be included.

Entity relations:
- Has_qualifier("macular edema", "both eyes")
- Has_qualifier("intravitreal anti-VEGF treatment", "both eyes")